Clinical trial inclusion criterion:
Person wears prosthesis daily and = 8 hours/day.

Entity relations:
- Has_multiplier("prosthesis", "daily and = 8 hours/day")